Clinical trial inclusion criterion:
Suspicion of neurologic dysfunction at tested sites

Entity relations:
- Has_qualifier("neurologic dysfunction", "tested sites")
- Has_mood("neurologic dysfunction", "Suspicion")